¿Cuál de los siguientes virus es un flavivirus?
1. Virus respiratorio sincitial.
2. Rinovirus.
3. Virus del eritema infeccioso.
4. Virus del dengue.

Respuesta correcta: 4. Virus del dengue.